The presence of acute infectious and/or communicable illnesses within 1 month prior to study;

The above is a clinical trial exclusion criterion. Annotated with entity spans:
The presence of [Qualifier: acute] [Condition: infectious] and/or [Condition: communicable illnesses] [Temporal: within 1 month prior to study];